Capable of providing written informed consent

The above is a clinical trial inclusion criterion. Annotated with entity spans:
[Post-eligibility: Capable of providing written informed consent]